Clinical trial inclusion criteria:
Histologically confirmed primary breast cancer
Planned to start docetaxel component of FEC-D or AC-D, or first cycle of; dose-dense AC-T, TC, FEC-D or TAC chemotherapy
=19 years of age
Able to provide verbal consent

Annotated entities:
- Condition: "primary breast cancer"
- Qualifier: "Histologically confirmed"
- Procedure: "Histologically"
- Drug: "docetaxel"
- Mood: "Planned to start"
- Procedure: "FEC-D"
- Procedure: "AC-D"
- Multiplier: "first cycle of"
- Procedure: "dose-dense AC-T"
- Procedure: "TC"
- Procedure: "FEC-D"
- Procedure: "TAC chemotherapy"
- Person: "age"
- Value: "=19 years"
- Informed_consent: "Able to provide verbal consent"